Clinical trial inclusion criterion:
Serum creatinine =1.5 mg/dl or eGFR=60(ml/min/1.73 m2)

Entity relations:
- Has_value("eGFR", "=60(ml/min/1.73 m2)")
- Has_value("Serum creatinine", "=1.5 mg/dl")
- OR("Serum creatinine", "eGFR")